Clinical trial exclusion criterion:
1. Active thromboembolic disease, history of thromboembolic disease (including retinal vein or artery occlusion), known inherited thrombophilia, or family history of thrombosis in a first degree relative

Annotated entities:
- Condition: "thromboembolic disease"
- Condition: "thromboembolic disease"
- Temporal: "history"
- Temporal: "Active"
- Condition: "retinal vein"
- Condition: "artery occlusion"
- Condition: "inherited thrombophilia"
- Observation: "family history"
- Condition: "thrombosis"
- Observation: "in a first degree relative"